Clinical trial exclusion criterion:
cirrhosis of the liver

Annotated entities:
- Condition: "cirrhosis of the liver"